Clinical trial exclusion criterion:
19. Known intolerance to study drugs.

Annotated entities:
- Parsing_Error: "19."
- Condition: "intolerance"
- Drug: "study drugs"
- Context_Error: "intolerance to study drugs"